Clinical trial inclusion criteria:
18 - 64 years old
Able to give consent
unprotected sex (in past 6 months) with 1 or more men of unknown HIV status
evaluated for an STI within 6 months prior to screening
sex in last 6 months with an HIV-infected partner
IDU with report of using previously used or shared needles in past 6 months or has been in a methadone, buprenorphine, or suboxone treatment program in past 6 months or engaging in high-risk sexual behaviors
individuals engaging in transactional sex (i.e sex for money, drugs, or housing)
Infrequently uses condoms during sex with 1 or more partners of unknown HIV status who are known to be at substantial risk of HIV infection (IDU or bisexual male partner)
CrCl = 60 ml/min
HIV- uninfected women desiring PrEP

Annotated entities:
- Value: "18 - 64 years"
- Person: "old"
- Non-query-able: "Able to give consent"
- Observation: "unprotected sex"
- Temporal: "in past 6 months"
- Multiplier: "1 or more"
- Person: "men of unknown HIV status"
- Procedure: "evaluated for an STI"
- Temporal: "within 6 months prior to screening"
- Reference_point: "screening"
- Observation: "sex"
- Person: "HIV-infected partner"
- Temporal: "in last 6 months"
- Observation: "using previously used or shared needles"
- Temporal: "in past 6 months"
- Drug: "methadone"
- Drug: "buprenorphine"
- Drug: "suboxone"
- Procedure: "treatment program"
- Temporal: "in past 6 months"
- Observation: "engaging in high-risk sexual behaviors"
- Person: "IDU"
- Observation: "transactional sex"
- Observation: "sex for money"
- Observation: "sex for drugs"
- Observation: "sex for housing"
- Observation: "Infrequently uses condoms during sex"
- Multiplier: "1 or more"
- Person: "partners of unknown HIV status"
- Observation: "at substantial risk of HIV infection"
- Person: "IDU"
- Person: "bisexual male partner"
- Measurement: "CrCl"
- Value: "= 60 ml/min"
- Condition: "HIV- uninfected"
- Person: "women"
- Procedure: "PrEP"
- Mood: "desiring"